Clinical trial inclusion criterion:
NOSE score greater than 55

Entity relations:
- Has_value("NOSE score", "greater than 55")